Age < 20 or > 35 years.

The above is a clinical trial exclusion criterion. Annotated with entity spans:
[Person: Age] [Value: < 20 or > 35 years].